血小板不具有下列何者？
A. 細胞核（nucleus）
B. 微絲（microfilament）
C. 高爾基氏體（Golgi apparatus）
D. 粒線體（mitochondria）

正確答案：A. 細胞核（nucleus）